Male or female < 18 and > 62 years of age

The above is a clinical trial exclusion criterion. Annotated with entity spans:
[Person: Male] or [Person: female] [Value: < 18 and > 62 years] of [Person: age]